Clinical trial inclusion criterion:
Eligible for Mifeprex(r) at a study clinical site

Annotated entities:
- Drug: "Mifeprex(r)"
- Mood: "Eligible for"
- Visit: "study clinical site"